Clinical trial exclusion criterion:
1. History of penetrating brain injury

Annotated entities:
- Temporal: "History"
- Condition: "penetrating brain injury"